Clinical trial inclusion criterion:
Colonization confirmed by our microbiology department, including at least 3 positives swabs in the last month

Annotated entities:
- Multiplier: "at least 3"
- Value: "positives"
- Procedure: "swabs"
- Temporal: "in the last mont"
- Condition: "Colonization"
- Qualifier: "confirmed by our microbiology department"